Clinical trial inclusion criterion:
12. Total serum bilirubin ≤1.5 × ULN

Entity relations:
- Has_value("Total serum bilirubin", "≤1.5 × ULN")